有關聽神經瘤（acoustic neuroma）的臨床敘述，下列何者錯誤？
A. 比較正確的名稱應為前庭神經鞘瘤、許旺氏細胞瘤（vestibular schwannoma）
B. 最常見的臨床症狀是單側或非對稱型的感音型聽損
C. 顏面神經麻痺是常見的臨床症狀
D. 純音及語音聽力檢查（pure tone and speech audiometry）為臨床上的篩檢工具

正確答案：C. 顏面神經麻痺是常見的臨床症狀